Which disease do pathogenic NR2F1 variants cause?

Bosch-Boonstra-Schaaf optic atrophy syndrome